Clinical trial exclusion criterion:
Prior use of levothyroxine

Annotated entities:
- Drug: "levothyroxine"
- Temporal: "Prior"